3. Male or female between the ages of 2-99.

The above is a clinical trial inclusion criterion. Annotated with entity spans:
[Parsing_Error: 3.] [Person: Male] or [Person: female] [Value: between] [Person: the ages] of 2-99.